Clinical trial inclusion criterion:
Presentation of suicidal ideation (= 3 on MADRS suicidal thoughts domain at time of study entry or at any time during study)

Annotated entities:
- Condition: "suicidal ideation"
- Value: "= 3"
- Measurement: "MADRS suicidal thoughts domain"
- Temporal: "at time of study entry"
- Temporal: "at any time during study"